What is pseudodementia?

Depression can cause some clinical symptoms and signs of dementia, classically in older adults. This type of "dementia" is called pseudodementia and is typically reversible with treatment.